Una de las siguientes NO es una pauta que deba guiar las intervenciones en los Trastornos de Espectro Autista. Señale cuál:
1. Utilizar programas de enseñanza personalizados y fundamentados en un marco evolutivo.
2. Intervenir en un marco grupal para favorecer la adquisición de habilidades sociales.
3. Intervenir en contextos muy estructurados y predecibles.
4. Emplear procedimientos de aprendizaje sin errores.
5. Favorecer la motivación.

Respuesta correcta: 2. Intervenir en un marco grupal para favorecer la adquisición de habilidades sociales.